Salivary Cortisol is a biomarker for what disease/syndrome/condition?

Salivary cortisone , as a biomarker for psychosocial stress , is associated with state anxiety and heart rate .
ortisol as a stress biomarker